關於胃壁細胞（parietal cells）之敘述，下列何者錯誤？
A. H+/K+ ATPase幫浦位於壁細胞頂端細胞膜（apical membrane）
B. 壁細胞內之H+經由初級主動運輸（primary active transport）分泌至胃腔中
C. Cl- 經由位於壁細胞頂端細胞膜之通道分泌至胃腔中，此通道受到細胞內cAMP的調控
D. HCO3- 與Cl- 於壁細胞底側細胞膜（basolateral membrane）以共同運輸進入壁細胞

正確答案：D. HCO3- 與Cl- 於壁細胞底側細胞膜（basolateral membrane）以共同運輸進入壁細胞